Clinical trial exclusion criterion:
serious infection (neutropenia, tuberculosis)

Entity relations:
- Has_qualifier("infection", "serious")
- Subsumes("infection", "neutropenia")
- OR("neutropenia", "tuberculosis")